Clinical trial inclusion criterion:
Considered for a standard immunosuppressive protocol.

Annotated entities:
- Mood: "Considered for"
- Procedure: "standard immunosuppressive protocol"